分娩時，從連接胎盤一端的臍帶切口流出的血液源自下列何者？
A. 胎兒的動脈血及靜脈血
B. 母體的動脈血及胎兒的靜脈血
C. 胎兒的動脈血及母體的靜脈血
D. 胎兒和母體的動脈血及靜脈血

正確答案：A. 胎兒的動脈血及靜脈血